No mediastinal or celiac, or suspected metastatic lymph nodes by EUS,

The above is a clinical trial inclusion criterion. Annotated with entity spans:
[Negation: No] [Qualifier: mediastinal] or [Qualifier: celiac], or suspected [Qualifier: metastatic] [Condition: lymph nodes] by [Procedure: EUS],